Clinical trial exclusion criterion:
Allergy to study medication

Entity relations:
- AND("Allergy", "study medication")